一位 27 歲男性工人體重 79 kg，不慎在工地墜落造成失血性休克，送到醫院後急診醫師給予 2000 mL 等張輸液（isotonic solution）後，生命徵候有暫時改善，但不久血壓又下降，心跳又上升，請問此病人約流失多少的血液？
A. ＜550 mL
B. 550~1100 mL
C. 1500~2000 mL
D. 2500~3000 mL

正確答案：C. 1500~2000 mL